Clinical trial exclusion criterion:
(ii) measles (M) or measles, mumps, rubella (MMR) routine vaccination, which can be administered concomitantly with the first dose of study vaccine as per routine immunization schedule

Entity relations:
- Has_index("concomitantly with the first dose of study vaccine", "the first dose of study vaccine")
- Has_temporal("measles (M) vaccination", "concomitantly with the first dose of study vaccine")
- OR("measles (M) vaccination", "measles, mumps, rubella (MMR) vaccination")